Symptomatic or asymptomatic coronary artery disease patients

The above is a clinical trial inclusion criterion. Annotated with entity spans:
[Qualifier: Symptomatic] or [Qualifier: asymptomatic] [Condition: coronary artery disease] patients